the child has temperature > 39.0◦C or a severe acute illness as defined by the examining nurse

The above is a clinical trial exclusion criterion. Annotated with entity spans:
the [Person: child] has [Measurement: temperature] [Value: > 39.0◦C] or a [Qualifier: severe] [Condition: acute illness] [Qualifier: as defined by the examining nurse]